Any clinically significant abnormality or medical history or physical examination including history of immunodeficiency or autoimmune disease (in addition to HCV infection, for HCV group)

The above is a clinical trial exclusion criterion. Annotated with entity spans:
Any clinically significant abnormality or medical history or physical examination including history of [Condition: immunodeficiency] or [Condition: autoimmune disease] ([Negation: in addition to] [Condition: HCV infection], for HCV group)